10. Pregnant women or women with reproductive potential who are sexually active and not using an acceptable form of contraception.

The above is a clinical trial exclusion criterion. Annotated with entity spans:
[Parsing_Error: 10.] [Condition: Pregnant] [Person: women] or [Person: women] with [Condition: reproductive potential] who are [Condition: sexually active] and [Negation: not] using an [Qualifier: acceptable form of] [Condition: contraception].